Patients without functional impairment of organs: liver function: total bilirubin, AST, ALT, alfa-GT and alkaline phosphatase less than 3 times the upper limit of normal laboratory renal function: serum creatinine < 2 mg/dL or clearance creatinine > 30 ml/min (except renal function attributable to LAL) cardiac function (Appendix B) normal: ventricular EF > 50%, absence of severe chronic respiratory disease. In the event that alterations are secondary to the disease is at the discretion of the investigator to determine if the patient can be included in the trial.

The above is a clinical trial inclusion criterion. Annotated with entity spans:
Patients [Negation: without] [Condition: functional impairment of organs]: liver function: [Measurement: total bilirubin], [Measurement: AST], [Measurement: ALT], [Measurement: alfa-GT] and [Measurement: alkaline phosphatase] [Value: less than 3 times the upper limit of normal] laboratory renal function: [Measurement: serum creatinine] [Value: < 2 mg/dL] or [Measurement: clearance creatinine] [Value: > 30 ml/min] [Non-representable: (except renal function attributable to LAL)] [Measurement: cardiac function] (Appendix B) [Value: normal]: [Measurement: ventricular EF] [Value: > 50%], [Negation: absence of] [Condition: severe chronic respiratory disease]. [Non-representable: In the event that alterations are secondary to the disease is at the discretion of the investigator to determine if the patient can be included in the trial].